Children in care: Children who are wards of the government or state are not eligible for participation in this study.

The above is a clinical trial exclusion criterion. Annotated with entity spans:
[Context_Error: Children in care: Children who are wards of the government or state are not eligible for participation in this study].